Clinical trial exclusion criterion:
Treatment with any other investigational drug within the last three months before Screening

Entity relations:
- AND("Treatment", "investigational drug")
- Has_index("within the last three months before Screening", "Screening")
- Has_temporal("Treatment", "within the last three months before Screening")